Clinical trial exclusion criterion:
Patients with pulmonary hypertension or unstable cardiopulmonary conditions

Entity relations:
- OR("pulmonary hypertension", "unstable cardiopulmonary conditions")